Clinical trial inclusion criterion:
Has had a self-reported visual exam in the last two years

Entity relations:
- Has_temporal("self-reported visual exam", "in the last two years")